Clinical trial inclusion criterion:
Provision of written informed consent (by patient or appropriate designee according to local regulations) prior to any study specific procedures.

Annotated entities:
- Post-eligibility: "Provision of written informed consent (by patient or appropriate designee according to local regulations) prior to any study specific procedures"